AND identical isolate in urine sample (>= 1.000 CFU) OR relevant clinical signs of UTI

The above is a clinical trial inclusion criterion. Annotated with entity spans:
AND [Value: identical isolate] in [Procedure: urine sample] ([Value: >= 1.000] [Measurement: CFU]) OR relevant [Mood: clinical signs] of [Condition: UTI]